What is particular about the 3D structure of the inactive X chromosome?

The mammalian inactive X chromosome (Xi) condenses into a bipartite structure with two superdomains of frequent long-range contacts, separated by a hinge region. Despite the importance of X chromosome inactivation, little is known about this 3D conformation. The inactive X chromosomes are the best examples of XCI in females, originally discovered as a compact 3D structure at the nuclear periphery known as the Barr body.